Clinical trial inclusion criterion:
Physician-led sedation (if sedated; as opposed to nurse-led protocol)

Entity relations:
- Has_qualifier("sedation", "Physician-led")
- Has_qualifier("Physician-led", "nurse-led protocol")
- Has_negation("nurse-led protocol", "as opposed to")